Clinical trial exclusion criterion:
Uterine abnormality

Annotated entities:
- Condition: "Uterine abnormality"